Clinical trial inclusion criterion:
Negative pregnancy test (blood ß-HCG dosage)

Annotated entities:
- Measurement: "pregnancy test"
- Value: "Negative"
- Measurement: "blood ß-HCG dosage"